early to moderate stage diabetic retinopathy (ETDRS: 20 (microaneurysms only) to 35 (microaneurysms/ hemorrhages and/or hard exsudates)) in one or both eyes

The above is a clinical trial inclusion criterion. Annotated with entity spans:
[Qualifier: early] to [Qualifier: moderate stage] [Condition: diabetic retinopathy] ([Measurement: ETDRS]: [Value: 20] (microaneurysms only) to [Value: 35] (microaneurysms/ hemorrhages and/or hard exsudates)) in one or both [Qualifier: eyes]